關於第一型維生素 D 依賴型佝僂症（Vitamin D-dependent rickets type 1）之敘述，下列何者錯誤？
A. 腎臟 1α-羥化酶（1α-hydroxylase）突變所致
B. 常於兩歲前發病
C. 低血清 25-hydroxyvitamin D 濃度
D. 可給予長效 calcitriol 治療

正確答案：C. 低血清 25-hydroxyvitamin D 濃度